Clinical trial exclusion criterion:
lack of ability to use the study devices

Entity relations:
- Has_negation("ability to use the study devices", "lack of")
- multi("ability to use the study devices", "study devices")